Clinical trial inclusion criterion:
Minimum of 12 natural teeth

Annotated entities:
- Multiplier: "Minimum of 12"
- Observation: "natural teeth"